一位18歲男性大學新生，一星期前入學體檢報告正常。三天前參加新生盃籃球比賽後關節酸痛，自行購買止痛藥（diclofenac）服用後開始出現小便泡沫與腳腫，故至門診求診。無嘔吐、腹瀉、發燒與頻尿症狀。理學檢查發現：血壓160/90 mmHg，呼吸速率每分	20下，四肢出現紅疹，雙下肢4+水腫。血液檢查：尿素 氮（BUN）52 mg/dL、肌酸酐：2.0 mg/dL，白蛋白1.8 g/dL，白血球7,000/μL，血色素10.2 g/dL，膽固醇
 mg/dL，三酸	油脂（triglyceride）260 mg/dL。尿液檢查：紅血球2～3顆/HPF，白血球3～5顆/HPF，尿液總蛋白質與肌酸酐比值為12 g/g Cr。下列何項為最可能的診斷？
A. hemolytic uremic syndrome
B. minimal change disease
C. rapidly progressive glomerulonephritis
D. IgA nephropathy

正確答案：B. minimal change disease